一位多重外傷的病人，為避免發生低體溫，除了給與烤燈、溫毛毯外，也可用加溫的 crystalloid 溶液來避免發生低體溫，此種 crystalloid 溶液最好加溫到幾度 C？
A. 37
B. 39
C. 41
D. 43

正確答案：B. 39